想檢查滑車神經（trochlear nerve）的作用時，一般是要受檢者的眼球往那個方向看？
A. 內上
B. 內下
C. 外下
D. 外上

正確答案：B. 內下